Clinical trial exclusion criterion:
history of neurological disorders which might affect sensation such as previous stroke or peripheral neuropathy

Entity relations:
- AND("neurological disorders", "affect sensation")
- Subsumes("neurological disorders", "stroke")
- OR("stroke", "peripheral neuropathy")